Clinical trial exclusion criterion:
Contraindications to disulfiram treatment (liver disease, kidney disease, cardiac disease, seizure disorder, hypothyroidism, diabetes mellitus, pregnancy or lactation, allergy to disulfiram or thiuran derivatives)

Entity relations:
- AND("allergy", "disulfiram")
- AND("Contraindications", "disulfiram")
- Subsumes("Contraindications", "liver disease")
- OR("disulfiram", "thiuran derivatives")
- OR("liver disease", "lactation", "pregnancy", "diabetes mellitus", "hypothyroidism", "seizure disorder", "cardiac disease", "kidney disease", "allergy")